Clinical trial exclusion criterion:
Previous immunosuppressive or cytotoxic medication, in the last 6 months. Individuals who have made use of this kind of medication in non-immunosuppressant doses, as nasal corticosteroid for allergic rhinitis of topic corticosteroid for non-complicated dermatitis, for more than 14 days, are allowed to be included in the study.

Annotated entities:
- Drug: "immunosuppressive medication"
- Drug: "cytotoxic medication"
- Undefined_semantics: "cytotoxic medication"
- Undefined_semantics: "immunosuppressive medication"
- Temporal: "in the last 6 months"
- Parsing_Error: "Individuals who have made use of this kind of medication in non-immunosuppressant doses, as nasal corticosteroid for allergic rhinitis of topic corticosteroid for non-complicated dermatitis, for more than 14 days, are allowed to be included in the study."
- Not_a_criteria: "Individuals who have made use of this kind of medication in non-immunosuppressant doses, as nasal corticosteroid for allergic rhinitis of topic corticosteroid for non-complicated dermatitis, for more than 14 days, are allowed to be included in the study."